What is the asosciation between the eustachian tube and the palatine muscle of the uvula?

The palatine musculature is involved in the opening of the eustachian tube.